Clinical trial exclusion criterion:
20. Inadequate venous access

Entity relations:
- Has_qualifier("venous access", "Inadequate")